一位病患發生左心室心肌梗塞後血壓降至 70 mmHg，下列敘述何者錯誤？
A. 心臟輸出量會下降
B. 左心房內壓力會上升
C. 肺微血管壓力會下降
D. 左心室收縮力會下降

正確答案：C. 肺微血管壓力會下降